Clinical trial inclusion criterion:
ASA I-III

Annotated entities:
- Measurement: "ASA"
- Value: "I-III"